6. Routine use (more than twice a week) of a chlorinated swimming pool.

The above is a clinical trial exclusion criterion. Annotated with entity spans:
[Parsing_Error: 6.] [Multiplier: Routine use] ([Multiplier: more than twice a week]) of a [Observation: chlorinated swimming pool].